Patients with coagulopathy or under anti-coagulation therapy.

The above is a clinical trial exclusion criterion. Annotated with entity spans:
Patients with [Condition: coagulopathy] or under [Procedure: anti-coagulation therapy].